有關性染色體（sex chromosome）異常疾病，下列敘述或處置何者最不正確？
A. 性染色體比體染色體數目異常疾病有更多 mosaicism 的情況
B. 多一個性染色體如：47，XXY 身材較高，而少一個如：45，X 較矮小
C. 核型 45，X/46，XY 患者 50%以上呈現性別難辨（ambiguous genitalia）
D. 透納氏症（Turner syndrome）若含有 Y 染色體物質應注意 gonadoblastoma 的發生

正確答案：C. 核型 45，X/46，XY 患者 50%以上呈現性別難辨（ambiguous genitalia）